Giant papillary conjunctivitis (GCP) worse than grade 1

The above is a clinical trial exclusion criterion. Annotated with entity spans:
[Condition: Giant papillary conjunctivitis (GCP)] [Qualifier: worse than grade 1]